Clinical trial exclusion criterion:
Subject with active peptic ulceration

Annotated entities:
- Qualifier: "active"
- Condition: "peptic ulceration"